在食道閉鎖（esophageal atresia）的畸型中，最常見的類型為何？
A. 食道閉鎖無併發瘻管（esophageal atresia without a tracheoesophageal fistula）
B. 食道閉鎖併近端瘻管（esophageal atresia with a proximal tracheoesophageal fistula）
C. 食道閉鎖併遠端瘻管（esophageal atresia with a distal tracheoesophageal fistula）
D. 食道閉鎖併雙瘻管（esophageal atresia with a double tracheoesophageal fistula）

正確答案：C. 食道閉鎖併遠端瘻管（esophageal atresia with a distal tracheoesophageal fistula）